下列關於威爾遜氏病（Wilson's disease）治療的敘述，何者正確？
A. 所有的病人都會在開始治療後惡化
B. 在整個療程中，飲食可以不必忌諱含銅食物
C. 在以 D-penicillamine 治療初期患者對藥過敏時，可重新減量或合併 prednisolone 之使用
D. 所有的病人都可使用 D-penicillamine 治療而得改善

正確答案：C. 在以 D-penicillamine 治療初期患者對藥過敏時，可重新減量或合併 prednisolone 之使用